乙醯輔酶A（acetyl coenzyme A）分子中，乙醯基與coenzyme A之鍵結為：
A. amide
B. Schiff 's base
C. acid anhydride
D. thioester

正確答案：D. thioester